Clinical trial exclusion criterion:
With any acute coronary syndrome complicated with acute pulmonary edema, cardiogenic shock and / or malignant ventricular arrhythmias.

Annotated entities:
- Condition: "acute coronary syndrome"
- Condition: "acute pulmonary edema"
- Condition: "cardiogenic shock"
- Condition: "ventricular arrhythmias"
- Qualifier: "malignant"